Contralateral phrenic nerve palsy

The above is a clinical trial exclusion criterion. Annotated with entity spans:
[Qualifier: Contralateral] [Condition: phrenic nerve palsy]